Clinical trial exclusion criterion:
Active infection, e.g., deep-tissue infection, that the Investigator considers sufficiently serious to preclude study participation

Annotated entities:
- Condition: "infection"
- Qualifier: "Active"
- Condition: "deep-tissue infection"